Clinical trial exclusion criterion:
Has an active infection requiring systemic therapy

Entity relations:
- Has_qualifier("infection", "requiring systemic therapy")
- Has_temporal("infection", "active")